下列何種器官由前腸（foregut）衍生而來？
A. 脾臟（spleen）
B. 膽囊（gallbladder）
C. 闌尾（appendix）
D. 空腸（jejunum）

正確答案：B. 膽囊（gallbladder）